Clinical trial exclusion criterion:
Estimated life expectancy <12 months;

Entity relations:
- Has_value("Estimated life expectancy", "<12 months")